大腸癌最常見的轉移路徑為何？
A. 經腸壁轉移
B. 經穿透腹膜轉移
C. 經由淋巴系統轉移
D. 經由血管轉移

正確答案：C. 經由淋巴系統轉移